Clinical trial inclusion criterion:
Healthy, term, breastfeeding infants who will be predominately breastfed for at least 6-months. This will be determined by answering yes/no to question 'do you intend to breastfeed until your infant is at least 6 months of age.'

Annotated entities:
- Condition: "Healthy"
- Condition: "term"
- Observation: "breastfeeding"
- Person: "infants"
- Observation: "predominately breastfed"
- Multiplier: "for at least 6-months"
- Non-representable: "This will be determined by answering yes/no to question 'do you intend to breastfeed until your infant is at least 6 months of age.'"